Clinical trial exclusion criterion:
Patients allergic to polyglycolic / trimethylene carbonate

Entity relations:
- AND("allergic", "polyglycolic carbonate")
- AND("allergic", "trimethylene carbonate")